產前檢查應該在知道懷孕之後愈早開始愈好，在第一次產前檢查（約在懷孕 8~12 週）的項目中，不包括下列那一項？
A. 血型、Rh 因子和尿液常規檢查
B. 血液常規檢查，包括地中海貧血的篩檢（平均紅血球體積 MCV）
C. 妊娠糖尿病篩檢
D. 梅毒篩檢

正確答案：C. 妊娠糖尿病篩檢